Clinical trial exclusion criterion:
Pregnant or breast feeding.

Annotated entities:
- Pregnancy_considerations: "Pregnant or breast feeding"